下列關於闌尾（appendix）之敘述，何項錯誤？
A. 起自盲腸的小型盲端管狀憩室（diverticulum）
B. 黏膜層（mucosa layer）之內襯上皮為複層扁平上皮（stratified squamous epithelium）
C. 有相當多的淋巴組織在黏膜下層（submucosa layer）
D. 外肌層（muscularis externa）有環走及縱走兩層

正確答案：B. 黏膜層（mucosa layer）之內襯上皮為複層扁平上皮（stratified squamous epithelium）